Clinical trial inclusion criteria:
Surgical patients 60 years of age or older
Surgery scheduled to last at least 2 hours (including time for anesthesia induction, etc)
English speaking ability.
Ability to give informed consent

Annotated entities:
- Value: "60 years or older"
- Person: "age"
- Procedure: "Surgery"
- Qualifier: "scheduled to last at least 2 hours"
- Non-representable: "including time for anesthesia induction, etc"
- Observation: "English speaking ability"
- Observation: "Ability to give informed consent"